Clinical trial exclusion criterion:
Fasting plasma glucose > 7,0 mM, HbA1c > 48 mmol/mol 3 months after RYGB

Entity relations:
- Has_value("Fasting plasma glucose", "> 7,0 mM")
- Has_value("HbA1c", "> 48 mmol/mol")
- Has_temporal("Fasting plasma glucose", "3 months after RYGB")
- OR("Fasting plasma glucose", "HbA1c")